Clinical trial inclusion criteria:
1. Male and female recipients of all races, ≥18 years of age.
2. Patients undergoing primary or subsequent deceased-donor or living donor kidney transplantation.
3. Subject and/or guardian must be able to provide informed consent.
4. Subject and/or guardian must be able to comply with the study protocol.

Annotated entities:
- Person: "Male"
- Person: "female"
- Value: "≥18 years"
- Person: "age"
- Multiplier: "primary"
- Multiplier: "subsequent"
- Procedure: "living donor kidney transplantation"
- Procedure: "deceased-donor kidney transplantation"
- Non-query-able: "Subject and/or guardian must be able to provide informed consent."
- Post-eligibility: "Subject and/or guardian must be able to provide informed consent."
- Non-query-able: "Subject and/or guardian must be able to comply with the study protocol."
- Post-eligibility: "Subject and/or guardian must be able to comply with the study protocol."